preoperative SpO2 less than 93%

The above is a clinical trial exclusion criterion. Annotated with entity spans:
[Temporal: preoperative] [Measurement: SpO2] [Value: less than 93%]